Clinical trial exclusion criterion:
Presence of severe systemic disease

Annotated entities:
- Qualifier: "severe"
- Condition: "systemic disease"